有關軟骨肉瘤（chondrosarcoma）的敘述，下列何者正確？
A. 大多數病人的年齡為20幾歲
B. 腫瘤內少有鈣化
C. 第一級（grade 1）腫瘤的轉移機率約10%
D. 見到第三級（grade 3）惡性軟骨之形態時，要先想到該腫瘤是否為軟骨母細胞骨肉瘤

正確答案：D. 見到第三級（grade 3）惡性軟骨之形態時，要先想到該腫瘤是否為軟骨母細胞骨肉瘤